Clinical trial exclusion criterion:
Presence of multiple factors that affect oral medications, such as difficulty swallowing, nausea, vomiting, chronic diarrhea and intestinal obstruction;

Annotated entities:
- Observation: "factors that affect oral medications"
- Condition: "difficulty swallowing"
- Condition: "nausea"
- Condition: "vomiting"
- Condition: "chronic diarrhea"
- Condition: "intestinal obstruction"